Clinical trial exclusion criterion:
Patients undergoing bilateral hip or knee replacement;

Entity relations:
- Has_qualifier("hip replacement", "bilateral")
- OR("hip replacement", "knee replacement")